Clinical trial inclusion criterion:
Unaware of HIV status at enrollment in follow-up cohort

Annotated entities:
- Measurement: "HIV status"
- Value: "Unaware"
- Observation: "Unaware of HIV status"
- Temporal: "at enrollment in follow-up cohort"
- Reference_point: "enrollment in follow-up cohort"